有關陰莖鱗狀細胞癌的敘述，下列何者錯誤？
A. 與 erythroplasia of Queyrat 的病灶無關
B. 常會轉移到腹股溝、腸骨淋巴腺
C. 發病率與個人生殖器衛生習慣有關
D. 與 HPV-16 及 HPV-18 有關係

正確答案：A. 與 erythroplasia of Queyrat 的病灶無關